Clinical trial inclusion criterion:
Undergoing ECT for treatment of their symptoms

Entity relations:
- Has_temporal("ECT", "Undergoing")